Clinical trial exclusion criterion:
Patients with renal impairment (serum creatinine more than twice the upper limit of normal).

Annotated entities:
- Condition: "renal impairment"
- Measurement: "serum creatinine"
- Value: "more than twice the upper limit of normal"